Clinical trial inclusion criterion:
Participants are given their written informed consent to participate in the study.

Annotated entities:
- Informed_consent: "Participants are given their written informed consent to participate in the study"